Clinical trial inclusion criterion:
Treatment naïve, i.e., no previous anti-VEGF treatment in the study eye or no anti-VEGF treatment in the 45 days prior to study enrollment.

Entity relations:
- Has_qualifier("anti-VEGF treatment", "in the study eye")
- Has_temporal("anti-VEGF treatment", "previous")
- Has_negation("anti-VEGF treatment", "no")
- Has_index("in the 45 days prior to study enrollment", "study enrollment")
- Has_temporal("anti-VEGF treatment", "in the 45 days prior to study enrollment")
- Has_negation("anti-VEGF treatment", "no")
- Subsumes("Treatment naïve", "anti-VEGF treatment")
- OR("anti-VEGF treatment", "anti-VEGF treatment")